Ante un paciente con una otitis externa difusa ¿Cuál es el tratamiento inicial?
1. Cirugía.
2. Antibióticos más analgésicos, ambos vía endovenosa.
3. Antibióticos y analgésicos, ambos vía oral.
4. Limpieza del conducto auditivo externo, antibioticoterapia tópica más analgésicos orales.
5. Antibióticos tópicos.

Respuesta correcta: 4. Limpieza del conducto auditivo externo, antibioticoterapia tópica más analgésicos orales.